Clinical trial inclusion criteria:
Patients undergoing laparoscopic assisted donor nephrectomy
Patients that have elected to have a nerve block
18 years of age or older
Patients of ASA status I - III

Annotated entities:
- Procedure: "laparoscopic assisted donor nephrectomy"
- Procedure: "nerve block"
- Mood: "elected to have"
- Value: "18 years or older"
- Person: "age"
- Measurement: "ASA status"
- Value: "I - III"